一個3歲男童，發燒、咳嗽三天，並有喉嚨痛與聲音沙啞。血液檢查白血球 11000/uL， 其中segment 佔 45%， lymphocyte 占50%，monocyte占
 3%， eosinophil占2%。身體診察肺部呼吸音較粗（coarse breathing 
 sound），沒有囉音（rales）或喘鳴聲（wheezing）。請依此回答下列3 題。X檢查如下，臨床診斷最有可能為下列何者？
A. 哮吼（croup）
B. 喉頭軟化（laryngomalacia）
C. 扁桃腺炎（tonsillitis）
D. 細菌性氣管炎（bacterial tracheitis）

正確答案：A. 哮吼（croup）